一位 55 歲女性病患因下背痛在門診接受檢查時，理學檢查無明顯異常，但檢閱先前的血液生化檢查時，發現她出現高血鈣和鹼性磷酸酵素（Alkaline phosphatase）增高，下列何項病因的可能性最小？
A. 多發性骨髓瘤
B. 轉移性骨骼病變
C. 副甲狀腺機能亢進症
D. 骨質疏鬆症

正確答案：D. 骨質疏鬆症